某同學因為膝部外側疼痛前來就診，在其股骨外踝（lateral femoral condyle）及外側副韌帶（lateral collateral ligament）的前方發現有一明顯的局部壓痛。詢問病史發現他有慢跑的習慣，但是檢查發現沒有明顯受傷。他最有可能的診斷為：
A. 膝外側半月板軟骨（lateral meniscus）破裂
B. 第三第四腰椎椎間盤突出（L3～L4 HIVD）
C. 腸脛束磨擦症候群（iliotibial band friction syndrome）
D. 膝外側副韌帶（lateral collateral ligament）扭傷

正確答案：C. 腸脛束磨擦症候群（iliotibial band friction syndrome）